¿Pueden aplicarse los métodos potenciométricos con electrodos de membrana a la determinación de especies moleculares?:
1. Sí, cuando reaccionan formando un complejo estable con los iones de la disolución.
2. No, porque estas determinaciones se realizan con electrodos selectivos de iones que solo detectan especies cargadas como el protón o el fluoruro.
3. Sí, pero las especies a determinar tienen que ser electroactivas.
4. Sí, utilizando una membrana permeable.

Respuesta correcta: 4. Sí, utilizando una membrana permeable.